Clinical trial inclusion criterion:
Age between 1 month and 24 months of age (not beyond second birthday at baseline).

Entity relations:
- Has_value("Age", "between 1 month and 24 months of age")